有關濫用大麻（cannabis）的作用，下列何者正確？
A. 其依賴主要為生理的依賴（physical dependence）而較少心理的依賴
B. 中毒時其動作協調變差（impaired motor coordination）
C. 戒斷時會產生嗜睡及食慾增加之症狀
D. 常見的生理反應包括明顯心搏變緩（bradycardia）及瞳孔縮小

正確答案：B. 中毒時其動作協調變差（impaired motor coordination）